Clinical trial exclusion criterion:
6. Current malignancy or history of a prior malignancy

Annotated entities:
- Parsing_Error: "6."
- Condition: "malignancy"
- Temporal: "Current"
- Condition: "malignancy"
- Temporal: "history of a prior"